Clinical trial exclusion criterion:
Patients who have received wide field radiotherapy ≤ 4 weeks or limited field radiation for palliation < 2 weeks prior to screening or who have not recovered adequately from side effects of such therapy.

Entity relations:
- Has_index("< 2 weeks prior to screening", "screening")
- Has_temporal("limited field radiation for palliation", "< 2 weeks prior to screening")
- Has_temporal("wide field radiotherapy", "≤ 4 weeks")
- Has_negation("recovered", "not")
- Has_qualifier("recovered", "adequately")
- AND("side effects of such therapy", "such therapy")
- AND("recovered", "side effects of such therapy")
- OR("wide field radiotherapy", "limited field radiation for palliation", "recovered")